Clinical trial inclusion criterion:
permit or license to drive

Entity relations:
- OR("permit to drive", "license to drive")